核小體（nucleosome）為染色質（chromatin）的基本單元，其組成是由四種不同的組織蛋白（histone）構成核心（core）以供 DNA 環繞其上，在 DNA 進出核心組織蛋白處，由一特定的組織蛋白所連接，請指出該連接蛋白（linker protein）的名稱為何？
A. H1 組織蛋白
B. H2AB 組織蛋白
C. H3 組織蛋白
D. H4 組織蛋白

正確答案：A. H1 組織蛋白